Patients that are immunologically compromised, or receiving chronic steroids (>30 days), excluding inhalers

The above is a clinical trial exclusion criterion. Annotated with entity spans:
Patients that are [Condition: immunologically compromised], or receiving [Qualifier: chronic] [Drug: steroids] ([Temporal: >30 days]), [Negation: excluding] [Drug: inhalers]